一位 32 歲女性病人主訴最近 3 個月手指遇冷水或生氣時膚色便會轉為蒼白色，同時覺得有些吞嚥困難，且半夜時常胃酸逆流到嘴裡。2 星期前，開始時常乾咳，且稍微運動便覺得喘。下列的檢查，那項最不必要？
A. 運動心電圖
B. 心臟超音波
C. 胸部 X 光
D. 肺功能檢查

正確答案：A. 運動心電圖